下列有關周邊血液紅血球病變的敘述，何者錯誤？
A. 具有靶狀細胞（target cells），則病人可能有慢性酒精中毒、脾臟切除，或海洋性貧血等
B. 紅血球具有好威爾-久麗氏體（Howell-Jolly bodies），則病人可能有脾臟切除之病史
C. 紅血球具有嗜鹼性彩斑（basophilic stippling），則病人骨髓可能受到藥物或毒素的傷害
D. 具有裂細胞（schistocytes），則病人可能有缺鐵性貧血

正確答案：D. 具有裂細胞（schistocytes），則病人可能有缺鐵性貧血